下列有關腹主動脈瘤（abdominal aortic aneurysm）手術適應症之敘述，何者錯誤？
A. 最大直徑> 5.5 cm，應手術治療
B. 最大直徑介於4.0～5.0 cm且每年增加1 cm，應手術治療
C. 合併有腹痛，背痛或是血栓形成造成周邊動脈堵塞，應立即手術治療
D. 破裂的腹主動脈瘤，手術死亡率極高，並不建議立即手術治療

正確答案：D. 破裂的腹主動脈瘤，手術死亡率極高，並不建議立即手術治療